El informe de tipo verbal puede ser también considerado como:
1. El Efecto Barnum.
2. Una entrevista de Devolución.
3. Una entrevista estructurada.
4. Como un simple recuento de los datos obtenidos de las pruebas.
5. Nunca es aconsejable un informe de este tipo.

Respuesta correcta: 2. Una entrevista de Devolución.